Clinical trial exclusion criterion:
Contraindication or intolerance to evidence-based therapy for CHF, such as beta-blocker, angiotensin-converting enzyme inhibitor or angiotensin receptor blocker.

Annotated entities:
- Condition: "Contraindication"
- Condition: "intolerance"
- Procedure: "evidence-based therapy"
- Condition: "CHF"
- Drug: "beta-blocker"
- Drug: "angiotensin-converting enzyme inhibitor"
- Drug: "angiotensin receptor blocker"